Clinical trial inclusion criterion:
Male or female who is among 20 to 80 years of age at screening.

Entity relations:
- Has_value("age", "20 to 80 years")
- Has_temporal("age", "at screening")
- OR("Male", "female")